Clinical trial exclusion criterion:
congenital or acquired bleeding tendency

Annotated entities:
- Qualifier: "acquired"
- Qualifier: "congenital"
- Condition: "bleeding tendency"